Diabetes insipidus

The above is a clinical trial exclusion criterion. Annotated with entity spans:
[Condition: Diabetes insipidus]